較小區域如眼瞼（eyelid）處皮膚缺損時，宜用：
A. 薄部分皮層植皮（thin split thickness skin graft）
B. 人工皮
C. 全層皮移植（full thickness skin graft）
D. 肌肉皮瓣（myocutaneous flap）

正確答案：C. 全層皮移植（full thickness skin graft）